Clinical trial inclusion criterion:
Hepatitis B e antigen (HBeAg)-negative and anti-HBeAg positive.

Entity relations:
- Has_value("Hepatitis B e antigen", "negative")
- Has_value("anti-HBeAg", "positive")
- Subsumes("Hepatitis B e antigen", "HBeAg")